Which complex is bound by estrogen-related receptor β (Esrrb)?

Co-motif discovery identifies an Esrrb-Sox2-DNA ternary complex as a mediator of transcriptional differences between mouse embryonic and epiblast stem cells.